Clinical trial exclusion criterion:
Metabolic disease contraindicating use of the ketogenic diet e.g. pyruvate carboxylase deficiency, MCAD from previous medical investigation and screening at baseline.

Annotated entities:
- Condition: "Metabolic disease"
- Condition: "contraindicating"
- Procedure: "ketogenic diet"
- Condition: "pyruvate carboxylase deficiency,"
- Condition: "MCAD"